Previous adverse reaction to any of the antimalarial drugs used in this study.

The above is a clinical trial exclusion criterion. Annotated with entity spans:
[Temporal: Previous] [Condition: adverse reaction] to any of the [Drug: antimalarial drugs] [Qualifier: used in this study].